Receipt of an investigational product (within 30 days before vaccination).

The above is a clinical trial exclusion criterion. Annotated with entity spans:
[Competing_trial: Receipt of an investigational product (within 30 days before vaccination).]